What gene is mutated in Huntington's disease?

Huntington disease  is a progressive neurodegenerative disorder and is caused by an expanded trinucleotide CAG (polyQ) motif in the HTT gene.